Weight loss drugs other than metformin

The above is a clinical trial exclusion criterion. Annotated with entity spans:
[Observation: Weight loss] drugs [Negation: other] than [Drug: metformin]